What is the function of penicillinase, also known as beta lactamase?

Beta-lactamases are a family of serine enzymes that hydrolyse beta-lactam antibiotics following an acylation-deacylation mechanism.